Clinical trial inclusion criterion:
Women

Annotated entities:
- Person: "Women"